下列何項無法由簡單的精液檢查（semen analysis）得知？
A. 精子活動力（sperm motility）
B. 精子濃度（sperm concentration）
C. 精子外觀正常比例（sperm morphology）
D. 精子穿透力（sperm penetration）

正確答案：D. 精子穿透力（sperm penetration）